下列何者不影響最小肺泡濃度（minimum alveolar concentration）值？
A. 高血壓
B. 肌肉鬆弛拮抗劑
C. 缺氧（PaO2 < 40 mmHg）
D. 使用reserpine

正確答案：A. 高血壓